Clinical trial inclusion criterion:
proven acute deep venous thrombosis, less than 21 days and who were referred to the interventional radiology department.

Annotated entities:
- Qualifier: "acute"
- Condition: "deep venous thrombosis"
- Qualifier: "proven"
- Multiplier: "less than 21 days"
- Visit: "interventional radiology department"
- Mood: "referred to"